Patients who are allergic to IP or macrolide compounds.

The above is a clinical trial exclusion criterion. Annotated with entity spans:
Patients who are [Condition: allergic] to [Drug: IP] or [Drug: macrolide] compounds.